Subjects aged 18 to 80 years old

The above is a clinical trial inclusion criterion. Annotated with entity spans:
Subjects [Person: aged] [Value: 18 to 80 years old]